History of constipation

The above is a clinical trial exclusion criterion. Annotated with entity spans:
History of [Condition: constipation]